Clinical trial inclusion criteria:
Any allogeneic stem cell transplant recipient = 14 years of age and = 60 years of age
Bilirubin/ SGOT/SGPT < 5 × upper normal limits.
Creatinine < 2 × upper normal limits.
Ejection fraction = 50%, no severe arrhythmia.
Estimated life expectancy = 6 months.
Patients' CMV-DNA = 1000cp/ml in treatment group and being negative in prophylactic group.

Annotated entities:
- Procedure: "allogeneic stem cell transplant"
- Value: "= 14 years"
- Person: "age"
- Value: "= 60 years"
- Person: "age"
- Measurement: "Bilirubin"
- Measurement: "SGOT"
- Measurement: "SGPT"
- Value: "< 5 × upper normal limits"
- Measurement: "Creatinine"
- Value: "< 2 × upper normal limits"
- Measurement: "Ejection fraction"
- Value: "= 50%"
- Negation: "no"
- Qualifier: "severe"
- Condition: "arrhythmia"
- Observation: "Estimated life expectancy"
- Value: "= 6 months"
- Measurement: "CMV-DNA"
- Value: "= 1000cp/ml"
- Person: "treatment group"
- Person: "prophylactic group"
- Value: "negative"